Patients with type I diabetes or poorly controlled type II diabetes (Hb1Ac>8.5).

The above is a clinical trial exclusion criterion. Annotated with entity spans:
Patients with [Condition: type I diabetes] or [Qualifier: poorly controlled] [Condition: type II diabetes] ([Measurement: Hb1Ac][Value: >8.5]).